Clinical trial inclusion criterion:
5. Female patients of childbearing potential must have a negative pregnancy test at screening and must agree to use hormonal contraceptive, intrauterine device, diaphragm with spermicide, condom with spermicide, or abstinence throughout until 2 weeks after the last administration of study drug

Entity relations:
- Has_value("pregnancy test", "negative")
- Has_index("at screening", "screening")
- Has_temporal("pregnancy test", "at screening")
- Has_index("throughout until 2 weeks after the last administration of study drug", "last administration of study drug")
- Has_temporal("pregnancy test", "throughout until 2 weeks after the last administration of study drug")
- AND("childbearing potential", "pregnancy test")
- AND("childbearing potential", "Female")
- OR("pregnancy test", "intrauterine device", "diaphragm with spermicide", "condom with spermicide", "abstinence", "hormonal contraceptive")